Which CD38 antibody has been shown to be effective for Lupus Erythematosus?

Daratumumab, a human monoclonal antibody that targets CD38, has been used to treat Lupus Erythematosus.